List SLC25A46-related pathologies

SLC25A46-related pathologies include Charcot-Marie-Tooth disease type 2, Leigh syndrome, progressive myoclonic ataxia, lethal congenital pontocerebellar hypoplasia, autosomal dominant optic atrophy, Menkes disease, hyper-IgM with immunodeficiency syndrome (HIGM), and anterior pituitary aplasia.